Clinical trial exclusion criterion:
History of malignancy, except basal skin cell carcinoma

Entity relations:
- Has_negation("basal skin cell carcinoma", "except")